Indique cuál de las siguientes afirmaciones es cierta acerca de la bilirrubina:
1. Es un producto catabólico del grupo hemo.
2. Es un producto del ciclo de la urea.
3. Es un intermediario del ciclo de Krebs.
4. Es un precursor de la gluconeogénesis hepática.
5. Es un producto de degradación del colesterol.

Respuesta correcta: 1. Es un producto catabólico del grupo hemo.